Clinical trial exclusion criterion:
Preoperative use of an anticoagulant (Plavix, warfarin, lovenox, etc.)

Annotated entities:
- Temporal: "Preoperative"
- Drug: "anticoagulant"
- Drug: "Plavix"
- Drug: "warfarin"
- Drug: "lovenox"